El Informe psicológico debe tener la posibilidad de:
1. Ser redactado como el formato de una entrevista estructurada.
2. Utilizar cualquier prueba psicológica aunque no se encuentren adaptadas y baremadas en nuestro país.
3. Ser replicado o contrastado.
4. Ser vinculante para el Juez (en caso de Informe judicial).
5. Ser impersonalizado.

Respuesta correcta: 3. Ser replicado o contrastado.